Clinical trial exclusion criterion:
frequent urinary tract infections

Entity relations:
- Has_multiplier("urinary tract infections", "frequent")